Clinical trial exclusion criterion:
Chronic gastrointestinal system disorders

Annotated entities:
- Condition: "Chronic gastrointestinal system disorders"